Clinical trial exclusion criterion:
Associated with CNS (central nervous system) metastases;

Annotated entities:
- Condition: "metastases CNS"